陳先生 17 歲，最近發現右側睪丸有一 2.5 × 2.0 公分無痛性腫塊，陰囊超音波檢查發現副睪丸正常，右側睪丸有一低回音病灶（hypoechoic lesion），血液檢查腫瘤標記（tumor markers）甲型胎兒蛋白 （AFP）為 5 ng/mL，乙型人類脈絡膜生殖腺素（beta-hCG）< 5 mIU/mL，對陳先生下一步的建議應是：
A. 由陰囊開刀施行睪丸切片檢查，必要時睪丸切除
B. 由陰囊行超音波經皮睪丸切片檢查
C. 觀察，每年抽血測 AFP 及 beta-hCG
D. 經由腹股溝進行探查手術，必要時將睪丸切除

正確答案：D. 經由腹股溝進行探查手術，必要時將睪丸切除